How are CRM (cis-regulatory modules) defined?

Several tools allow to detect significant co-occurrences of closely located binding sites (cis-regulatory modules, CRMs).